El recuento de reticulocitos se utiliza para evaluar:
1. La formación de Cuerpos de Howell.
2. Una metaplasia mieloide.
3. La actividad eritropoyética.
4. Un proceso inflamatorio.

Respuesta correcta: 3. La actividad eritropoyética.